Clinical trial inclusion criterion:
at least 13 years old at the time of the procedure

Annotated entities:
- Value: "at least 13 years"
- Person: "old"
- Temporal: "at the time of the procedure"